Aspartate aminotransferase (AST)/Alanine aminotransferase (ALT) <10x upper limit of normal

The above is a clinical trial inclusion criterion. Annotated with entity spans:
[Measurement: Aspartate aminotransferase (AST)]/[Measurement: Alanine aminotransferase (ALT)] [Value: <10x upper limit of normal]